Clinical trial exclusion criterion:
Active uncontrolled bleeding

Entity relations:
- Has_qualifier("bleeding", "uncontrolled")
- Has_qualifier("bleeding", "Active")